Clinical trial exclusion criterion:
Have a CD4 cell count of 50 cells/mm3or less

Entity relations:
- Has_value("CD4 cell count", "50 cells/mm3or less")